What can be predicted with the Wells criteria?

Wells criteria are used to determine clinical probability of pulmonary embolism.